Clinical trial inclusion criteria:
Female subjects aged =/> 18 years and of reproductive age.
Capacity to give consent for study participation, after being adequately informed of the aims, benefits, risks, time and motion of the study.

Annotated entities:
- Person: "Female"
- Person: "aged"
- Value: "=/> 18 years"
- Condition: "reproductive age"
- Non-query-able: "Capacity to give consent for study participation, after being adequately informed of the aims, benefits, risks, time and motion of the study."